HbA1c > 13.0 %

The above is a clinical trial inclusion criterion. Annotated with entity spans:
[Measurement: HbA1c] [Value: > 13.0 %]